Clinical trial exclusion criterion:
Echocardiographic evidence of intracardiac mass, thrombus or vegetation.

Annotated entities:
- Procedure: "Echocardiographic"
- Condition: "intracardiac mass"
- Condition: "intracardiac thrombus"
- Condition: "intracardiac vegetation"